Clinical trial inclusion criterion:
Scheduled for total hip replacement surgery

Entity relations:
- Has_mood("total hip replacement surger", "Scheduled for")